Clinical trial inclusion criterion:
Candidate for Gastric By-Pass

Entity relations:
- Has_mood("Gastric By-Pass", "Candidate")